下列對於 Glucocorticoid 產生之臨床副作用，何者錯誤？
A. 導致庫興氏症候群（Cushing's syndrome）
B. 產生骨質疏鬆症
C. 產生消化性潰瘍
D. 使氣管收縮，引起氣喘之發作

正確答案：D. 使氣管收縮，引起氣喘之發作